Which tools have been developed for identifying and visualising ncRNA promoters?

The Eukaryotic Promoter Database (EPD) and ncPro-ML